Clinical trial exclusion criterion:
Untreated symptomatic brain or leptomeningeal metastatic disease.

Annotated entities:
- Condition: "symptomatic brain metastatic disease"
- Condition: "symptomatic leptomeningeal metastatic disease"
- Qualifier: "Untreated"